下列何者不構成手臂四角形空間（quadrangular space）的邊緣？
A. 小菱形肌（rhomboid minor）
B. 肱骨（humerus）
C. 大圓肌（teres major）
D. 肱三頭肌的長頭（long head of triceps brachii）

正確答案：A. 小菱形肌（rhomboid minor）